La técnica electroforética conocida como SDSPAGE es muy utilizada en la determinación de proteínas. En ella:
1. Se emplean geles poliméricos de agarosa y el surfactante produce fragmentos de proteína que se van separando en función de su carga/radio.
2. La muestra disuelta en SDS se aplica por gravedad, de forma que el depósito de muestra, elevado por encima de la fuente de alto voltaje permite la inyección en geles muy restrictivos.
3. Se produce una electroforesis bidimensional, una primera en un gel de poliacrilamida y otra en un medio sólido modificado con SDS.
4. Se forman micelas entre el SDS y la proteína de forma que proveen una carga negativa por unidad de masa constante, y las proteínas se pueden separar atendiendo a su masa molar.

Respuesta correcta: 4. Se forman micelas entre el SDS y la proteína de forma que proveen una carga negativa por unidad de masa constante, y las proteínas se pueden separar atendiendo a su masa molar.